Planning to move out of the area during the study time frame

The above is a clinical trial exclusion criterion. Annotated with entity spans:
[Non-query-able: Planning to move out of the area during the study time frame]